Clinical trial exclusion criterion:
Subjects with hemoglobin SC or SB+ thalassemia

Entity relations:
- OR("hemoglobin SC", "SB+ thalassemia")